Clinical trial exclusion criterion:
4. AML in relapse or refractory after 3 or more previous lines of chemotherapy (and/or HSCT) treatment

Annotated entities:
- Condition: "AML"
- Qualifier: "in relapse"
- Qualifier: "refractory"
- Temporal: "after 3 or more previous lines of chemotherapy"
- Multiplier: "3 or more"
- Temporal: "previous"
- Procedure: "lines of chemotherapy"